Clinical trial inclusion criterion:
Cancer, with no active treatment in the last year

Entity relations:
- Has_temporal("active treatment", "in the last year")
- Has_negation("active treatment", "no")
- AND("Cancer", "active treatment")